Any evidence of clinical autoimmunity.

The above is a clinical trial exclusion criterion. Annotated with entity spans:
[Condition: Any evidence of clinical autoimmunity].